American Society of Anesthesiologists Physical Status Classification (ASA) 1-2

The above is a clinical trial inclusion criterion. Annotated with entity spans:
[Measurement: American Society of Anesthesiologists Physical Status Classification] ([Measurement: ASA]) [Value: 1-2]